Clinical trial exclusion criterion:
Previous treatment by chemoembolization, radiofrequency less than 3 months before radioembolization

Annotated entities:
- Procedure: "chemoembolization"
- Procedure: "radiofrequency"
- Temporal: "less than 3 months before radioembolization"
- Reference_point: "radioembolization"